Clinical trial exclusion criterion:
use of loop diuretics

Annotated entities:
- Drug: "loop diuretics"